Patients with clinically symptomatic brain metastases

The above is a clinical trial exclusion criterion. Annotated with entity spans:
Patients with [Observation: clinically symptomatic] [Condition: brain metastases]